Clinical trial inclusion criteria:
Age 18 years or older
Mechanical ventilation
IAP between 12 and 20 mmHg in at least two consecutive measurements within 1-12 h
Spontaneous breathing activity of at least 6 breaths/minute
RASS score between 0 and -4
Physician-led sedation (if sedated; as opposed to nurse-led protocol)

Annotated entities:
- Person: "Age"
- Value: "18 years or older"
- Procedure: "Mechanical ventilation"
- Measurement: "IAP"
- Value: "between 12 and 20 mmHg"
- Multiplier: "at least two consecutive measurements"
- Temporal: "within 1-12 h"
- Measurement: "Spontaneous breathing activity"
- Value: "at least 6 breaths/minute"
- Measurement: "RASS score"
- Value: "between 0 and -4"
- Procedure: "sedation"
- Qualifier: "Physician-led"
- Negation: "as opposed to"
- Qualifier: "nurse-led protocol"